60歲女性因血壓較高至門診追蹤，無其它異常。平日不抽菸，每日睡前喝紅酒30 mL。父親死於腦中風、母親有糖尿病。血壓170/100 mmHg，身體質量指數（BMI）27.1 kg/m2。應建議她如何作生活型態改變？
A. 應減輕體重
B. 每日鈉攝取量應低於6 gm
C. 每日酒精攝取量應降低
D. 生活型態對血壓的影響，目前尚無實證支持

正確答案：A. 應減輕體重